Clinical trial exclusion criterion:
Patients with chronic and acute inflammatory conditions such as sepsis, rheumatoid arthritis, ectopic dermatitis, asthma, ulcerative colitis.

Annotated entities:
- Qualifier: "chronic"
- Qualifier: "acute"
- Condition: "inflammatory conditions"
- Condition: "sepsis"
- Condition: "rheumatoid arthritis"
- Condition: "ectopic dermatitis"
- Condition: "asthma"
- Condition: "ulcerative colitis"